Las cefalosporinas de tercera generación:
1. Su representante es la cefepima.
2. Deben evitarse en las infecciones por Enterobacter.
3. No son útiles en las meningitis secundarias a neumococo.
4. Son de elección en las meningitis por Listeria.
5. Nunca deben asociarse a un aminoglucósido.

Respuesta correcta: 2. Deben evitarse en las infecciones por Enterobacter.